Serious or unstable cardiac, renal, neurologic, cerebrovascular, metabolic, or pulmonary disease

The above is a clinical trial exclusion criterion. Annotated with entity spans:
[Qualifier: Serious] or [Qualifier: unstable] [Condition: cardiac], [Condition: renal], [Condition: neurologic], [Condition: cerebrovascular], [Condition: metabolic], or [Condition: pulmonary disease]